Which software package is available for the analysis of conserved genomic loci?

PHYLUCE is a software package for the analysis of conserved genomic loci